The presence of cycles until the age of 40 years with proven fertility, at least one child

The above is a clinical trial inclusion criterion. Annotated with entity spans:
[Pregnancy_considerations: The presence of cycles until the age of 40 years with proven fertility, at least one child]